Describe the web application VICTOR

VICTOR is a visual analytics web application which allows the visual comparison of the results of various clustering algorithms.